Clinical trial inclusion criterion:
Mild male factor infertility or unexplained infertility.

Entity relations:
- Has_qualifier("male factor infertility", "Mild")
- OR("male factor infertility", "unexplained infertility")